Clinical trial exclusion criterion:
Current or previous history of immune deficiency disorders including a positive human immunodeficiency virus (HIV) result.

Entity relations:
- Has_value("human immunodeficiency virus (HIV)", "positive")
- Subsumes("immune deficiency disorders", "human immunodeficiency virus (HIV)")
- Has_temporal("immune deficiency disorders", "Current")
- OR("Current", "previous history")